Known allergies against ingredients of the investigational products

The above is a clinical trial inclusion criterion. Annotated with entity spans:
Known [Condition: allergies] against [Drug: ingredients of the investigational products]